Clinical trial exclusion criterion:
Any cases giving clinical symptoms of gastritis e.g. nausea, vomiting, dull aching pain or soreness in the epigastrium.

Entity relations:
- Has_mood("gastritis", "clinical symptoms")
- Subsumes("gastritis", "nausea")
- OR("nausea", "dull aching pain", "vomiting", "soreness in the epigastrium")